Male or female >=18 years of age.

The above is a clinical trial inclusion criterion. Annotated with entity spans:
[Person: Male] or [Person: female] [Value: >=18 years] of [Person: age].